下列疾病患者在使用小兒麻痺口服沙賓活病毒疫苗後，其中何者引起癱瘓性脊髓灰質炎（poliomyelitis）的風險較高？
A. 狄喬治氏症候群（DiGeorge syndrome）
B. Bruton氏病（性聯丙種免疫球蛋白缺乏血症）（X-linked agammaglobulinemia [Bruton disease]）
C. 慢性肉芽腫疾病（chronic granulomatous disease）
D. 威斯科特－奧爾德里奇症候群（Wiskott-Aldrich syndrome）

正確答案：B. Bruton氏病（性聯丙種免疫球蛋白缺乏血症）（X-linked agammaglobulinemia [Bruton disease]）